7. When available, subjects will be screened for stability of blood CD4 and HIV RNA levels.

The above is a clinical trial inclusion criterion. Annotated with entity spans:
7. [Not_a_criteria: When available, subjects will be screened for stability of blood CD4 and HIV RNA levels.]